Treatment with insulin

The above is a clinical trial exclusion criterion. Annotated with entity spans:
[Procedure: Treatment] with [Drug: insulin]